有關休克的臨床定義，下列何者最適切？
A. 血壓過低
B. 組織灌流不良
C. 為一種昏厥現象
D. 體液流失過多

正確答案：B. 組織灌流不良